Clinical trial exclusion criterion:
no consent

Annotated entities:
- Informed_consent: "no consent"